Clinical trial exclusion criterion:
Patients with severe cardiac insufficiency patients taking Coumadin or other warfarin-containing agents with the exception of low dose warfarin (1 mg or less) for the maintenance of in-dwelling lines or ports

Annotated entities:
- Condition: "severe cardiac insufficiency"
- Drug: "Coumadin"
- Drug: "warfarin-containing agents"
- Qualifier: "low dose"
- Drug: "warfarin"
- Multiplier: "1 mg or less"
- Device: "in-dwelling lines"
- Device: "in-dwelling ports"
- Negation: "with the exception of"